Clinical trial exclusion criterion:
Chronic diathesis

Annotated entities:
- Condition: "diathesis"
- Qualifier: "Chronic"